人單核球艾利希氏體症（human monocytotropic ehrlichiosis）會有持續發燒、頭痛、全身或局部肌肉痛、肝脾及淋巴結腫大等症狀，通常較少出現皮膚斑疹，是由 Ehrlichia canis 感染所致，屬於新興傳染病的一種。關於此症的敘述，下列何者錯誤？
A. 該疾病可用 Doxycycline 或 Tetracycline 進行治療
B. 該致病原之傳播媒介以壁虱（硬蜱）為主
C. 該致病原會寄生在感染者的顆粒球、單核球、紅血球及血小板細胞中
D. 該致病原之細胞壁主要由 peptidoglycan 組成

正確答案：D. 該致病原之細胞壁主要由 peptidoglycan 組成